若患者之新鮮糞便中含有感染型（infective form），則照顧患者之醫護人員較易受到感染的寄生蟲是：
A. 環孢子蟲（Cyclospora cayetanensis）
B. 人肉孢子蟲（Sarcocystis hominis）
C. 等孢子蟲（Isospora belli）
D. 隱孢子蟲（Cryptosporidium parvum）

正確答案：D. 隱孢子蟲（Cryptosporidium parvum）